Clinical trial exclusion criterion:
Predominant overactive bladder symptoms

Annotated entities:
- Condition: "overactive bladder symptoms"
- Qualifier: "Predominant"
- Condition: "overactive bladder"